¿Qué autor ha hipotetizado que “el hecho de enfrentarse activamente a experiencias preocupantes, mediante el diálogo o la escritura, permitiría reducir los efectos negativos de la inhibición de la emoción”?
1. Friedman.
2. Pennebaker.
3. Pervin.
4. Costa.
5. Kobasa.

Respuesta correcta: 2. Pennebaker.